3. Cardiogenic shock on presentation or during current hospitalization.

The above is a clinical trial exclusion criterion. Annotated with entity spans:
3. [Condition: Cardiogenic shock] on presentation or during [Temporal: current] [Procedure: hospitalization].